Clinical trial inclusion criterion:
Patients with a lesion > 0.5 cm in largest diameter size, initially scored BI-RADS® 3, 4a, 4b or 4c in B-mode ultrasound

Annotated entities:
- Condition: "lesion"
- Value: "> 0.5 cm"
- Measurement: "largest diameter size"
- Measurement: "BI-RADS®"
- Value: "3, 4a, 4b or 4c"
- Procedure: "B-mode ultrasound"